What is Synucleinopathy?

Synucleinopathy is an autosomal recessive neurodegenerative disease characterized by the degeneration of substantia nigra pars compacta (SNpc) dopaminergic neurones and the formation of Lewy neurites in central nervous system